Clinical trial exclusion criterion:
Parkinson's disease with impulse Control disorder (ICD)

Entity relations:
- AND("Parkinson's disease", "impulse Control disorder (ICD)")